Clinical trial inclusion criterion:
The participant is an outpatient of either sex aged >= 30 and < 80 years.

Entity relations:
- Has_value("aged", ">= 30 and < 80 years")